Clinical trial inclusion criterion:
Age = 65 years with one additional stroke risk factor (hypertension, diabetes, heart failure history of or left ventricular ejection fraction <0.40), previous stroke or transient ischemic attack).

Entity relations:
- Has_value("Age", "= 65 years")
- AND("risk factor", "stroke")
- Has_value("left ventricular ejection fraction", "<0.40")
- Has_temporal("left ventricular ejection fraction", "history")
- Has_temporal("stroke", "previous")
- Subsumes("risk factor", "hypertension")
- Has_multiplier("risk factor", "one additional")
- OR("hypertension", "diabetes", "heart failure", "left ventricular ejection fraction")
- OR("stroke", "transient ischemic attack")